Diagnosis of Type 2 Diabetes from at least 3 years;

The above is a clinical trial inclusion criterion. Annotated with entity spans:
Diagnosis of [Condition: Type 2 Diabetes] from [Temporal: at least 3 years];